¿Qué método elegiría para determinar el contenido de calcio, en una muestra de orina de 24h?
1. Una vez diluida la muestra a un volumen exacto, se realizaría una valoración con AEDT de una alícuota de la misma, a pH 10, con negro de eriocromo T como indicador.
2. Una vez diluida la muestra a un volumen exacto, se tomaría una alícuota y se añadiría oxalato para precipitar el calcio. El precipitado se disolvería y se valoraría con AEDT en las mismas condiciones.
3. Se trataría la muestra directamente, sin diluir, con un exceso de oxalato y, una vez retirado el precipitado, se valoraría una alícuota de la disolución remanente con AEDT en las mismas condiciones.
4. Una alícuota de la muestra, sin diluir, se valoraría con AEDT a pH 10, en las mismas condiciones.

Respuesta correcta: 2. Una vez diluida la muestra a un volumen exacto, se tomaría una alícuota y se añadiría oxalato para precipitar el calcio. El precipitado se disolvería y se valoraría con AEDT en las mismas condiciones.